Clinical trial exclusion criterion:
Known sensitivity to E. coli derived products

Entity relations:
- Has_qualifier("products", "E. coli derived")
- AND("sensitivity", "products")